Clinical trial exclusion criterion:
Intracranial tumour, vascular malformation or arterial aneurysm;

Annotated entities:
- Condition: "Intracranial tumour"
- Condition: "vascular malformation"
- Condition: "arterial aneurysm"